Clinical trial exclusion criterion:
Treated with greater than 5 mg of prednisone (or equivalent) daily in the last 3 months

Annotated entities:
- Multiplier: "greater than 5 mg"
- Drug: "prednisone"
- Multiplier: "daily"
- Temporal: "in the last 3 months"